¿Cuál de las siguientes afirmaciones sobre la hiperplasia nodular focal hepática es cierta?
1. Se considera que su aparición está relacionada con el consumo de anticonceptivos.
2. El riesgo de hemoperitoneo por rotura es similar al del adenoma.
3. Existe riesgo de degeneración tumoral.
4. Se comporta como una lesión focal hipovascular en la tomografía computerizada con administración de contraste.
5. En el estudio histológico de la lesión además de hepatocitos pueden observarse conductos biliares y otras células hepáticas.

Respuesta correcta: 5. En el estudio histológico de la lesión además de hepatocitos pueden observarse conductos biliares y otras células hepáticas.